Clinical trial exclusion criterion:
Coexisting causes of chronic liver disease - chronic viral hepatitis(B & C), autoimmune liver disease, hemochromatosis, Wilson's etc.

Entity relations:
- Subsumes("chronic liver disease", "chronic viral hepatitis B")
- OR("chronic viral hepatitis B", "chronic viral hepatitis C", "autoimmune liver disease", "hemochromatosis", "Wilson's")